Clinical trial exclusion criterion:
Pregnant.

Annotated entities:
- Condition: "Pregnant"